intolerance of or allergy to ticagrelor or prasugrel

The above is a clinical trial inclusion criterion. Annotated with entity spans:
[Condition: intolerance] of or [Condition: allergy] to [Drug: ticagrelor] or [Drug: prasugrel]